El producto mayoritario de la reacción de 2metilciclohexanol con HBr es:
1. 1-Bromo-2-metilciclohexano.
2. Metilciclohexano.
3. 1-Bromo-1-metilciclohexano.
4. 1-Metilciclohexano.
5. Ciclohexano.

Respuesta correcta: 3. 1-Bromo-1-metilciclohexano.